下列那一項是免疫球蛋白受器（Fc receptor）的主要功能？
A. 直接與抗原結合
B. 與 T 細胞受體（T cell receptor）結合
C. 增進吞噬功能（phagocytosis）
D. 刺激產生介白素-2（interleukin-2）

正確答案：C. 增進吞噬功能（phagocytosis）